Has had a chest x-ray within 2 months prior to Screening that shows an abnormality suggestive of a current active infection or malignancy

The above is a clinical trial exclusion criterion. Annotated with entity spans:
Has had a [Procedure: chest x-ray] [Temporal: within 2 months prior to Screening] that shows an [Condition: abnormality] [Mood: suggestive] of a [Temporal: current] [Qualifier: active] [Condition: infection] or [Condition: malignancy]